A moderate/severe COPD exacerbation that has not resolved at least 14 days prior to Visit 1 and at least 30 days following the last dose of oral corticosteroids (if applicable).

The above is a clinical trial exclusion criterion. Annotated with entity spans:
A [Qualifier: moderate]/[Qualifier: severe] [Condition: COPD exacerbation] that has [Negation: not] [Observation: resolved] [Temporal: at least 14 days prior to Visit 1] and [Temporal: at least 30 days following the last dose of oral corticosteroids] (if applicable).